Clinical trial inclusion criterion:
No previous treatment with Clopidogrel, Prasugrel or Ticagrelor.

Entity relations:
- AND("treatment", "Clopidogrel")
- Has_temporal("treatment", "previous")
- Has_negation("treatment", "No")
- OR("Clopidogrel", "Prasugrel", "Ticagrelor")